regular bowel care routine (at least four weeks)

The above is a clinical trial inclusion criterion. Annotated with entity spans:
[Observation: regular bowel care routine] ([Temporal: at least four weeks])